Clinical trial exclusion criterion:
CHF, angina or arrhythmias

Annotated entities:
- Condition: "CHF"
- Condition: "angina"
- Condition: "arrhythmias"